El antibiótico tetraciclina:
1. Se une a la subunidad 30S e inhibe la unión de los aminoacil-tRNA.
2. Inhibe la actividad peptidiltransferasa de la subunidad ribosómica 50S.
3. Se une a la subunidad ribosómica 50S e inhibe la translocación.
4. Inhibe la iniciación y origina una lectura errónea del mRNA.
5. Provoca la terminación prematura al actuar como un análogo del aminoacil-tRNA.

Respuesta correcta: 1. Se une a la subunidad 30S e inhibe la unión de los aminoacil-tRNA.